El criterio A para el diagnóstico de trastorno obsesivo-compulsivo (DSM-IV-TR) se cumple para las obsesiones y las compulsiones, las obsesiones se definen por las siguientes características, menos por una de ellas, ¿cuál es la FALSA?
1. Pensamientos, impulsos o imágenes recurrentes y persistentes experimentadas, en algún momento del trastorno, como intrusos y causan ansiedad o malestar significativo.
2. Los pensamientos, impulsos o imágenes no se reducen a simples preocupaciones excesivas sobre problemas de la vida real.
3. La persona intenta ignorar o suprimir esos pensamientos, impulsos o imágenes o neutralizarlos.
4. La persona no reconoce que estos pensamientos, impulsos o imágenes obsesivos son el producto de su mente.
5. La persona reconoce que estos pensamientos, impulsos o imágenes obsesivos son el producto de su mente y no vienen impuestos.

Respuesta correcta: 4. La persona no reconoce que estos pensamientos, impulsos o imágenes obsesivos son el producto de su mente.